Clinical trial exclusion criterion:
Patients with fibromyalgia or chronic pain syndromes such as rheumatoid arthritis, osteoarthritis, or lupus.

Annotated entities:
- Condition: "fibromyalgia"
- Condition: "chronic pain syndromes"
- Condition: "rheumatoid arthritis"
- Condition: "osteoarthritis"
- Condition: "lupus"